Overweight/Obese Adult patients (age 19 years -65)

The above is a clinical trial inclusion criterion. Annotated with entity spans:
[Condition: Overweight]/[Condition: Obese] [Person: Adult] patients ([Person: age] [Value: 19 years -65])